La ecuación de velocidad de van Deemter trata de justificar las contribuciones de los diferentes efectos que provocan el ensanchamiento de la banda cromatográfica, que fundamentalmente son de cuatro tipos:
1. Difusión de Eddy, volumen muerto y resistencia a la convección en ambas fases, móvil y estacionaria.
2. Longitud de la columna cromatográfica, difusión longitudinal en sentido axial y radical, y efecto Joule.
3. Viscosidad cinemática de la fase móvil, transporte de masa entre la fase móvil y la fase estacionaria, difusión transversal y longitudinal.
4. Efecto de la transferencia de masa en la fase estacionaria, en la fase móvil, difusión de Eddy y difusión molecular longitudinal.
5. Difusión molecular en dirección axial, difusión atómica radical, presión interna de la columna y viscosidad de la fase móvil.

Respuesta correcta: 4. Efecto de la transferencia de masa en la fase estacionaria, en la fase móvil, difusión de Eddy y difusión molecular longitudinal.